¿Dónde se originan las células de la cresta neural?
1. El tubo neural.
2. Los márgenes laterales de la placa neural.
3. Los somitas.
4. El endodermo del saco vitelino.

Respuesta correcta: 2. Los márgenes laterales de la placa neural.